年長女性發生的外陰癌（vulvar cancer）中，下列那種徵狀最常見？
A. 不正常出血
B. 惡臭味
C. 疼痛
D. 搔癢

正確答案：D. 搔癢